Clinical trial inclusion criterion:
3. Temperature >38C on admission or fever during the preceding 48 hours

Entity relations:
- Has_value("Temperature", ">38C")